Clinical trial inclusion criterion:
Subjects were to have a negative urine screen for alcohol, drugs of abuse (screening only), and cotinine.

Annotated entities:
- Measurement: "urine screen for alcohol"
- Measurement: "urine screen for drugs of abuse"
- Measurement: "urine screen for cotinine"
- Value: "negative"